Clinical trial exclusion criterion:
Contraindication to bariatric surgery

Annotated entities:
- Procedure: "bariatric surgery"
- Condition: "Contraindication"